Clinical trial inclusion criterion:
Ulcer located on the legs or feet, stage III or IV (Wagner Classification System)

Annotated entities:
- Condition: "Ulcer"
- Qualifier: "legs"
- Qualifier: "feet"
- Measurement: "stage"
- Value: "III or IV"
- Qualifier: "Wagner Classification System"